Which is the function of the PRDM9 protein in mammals?

PRDM9 is a major determinant of meiotic recombination hotspots in humans and mice.